¿Cuál de los siguientes fármacos utilizados en el tratamiento de la infertilidad femenina es un análogo de la hormona liberadora de gonadotropinas (GnRH) capaz de inhibir la esteroidogenésis gonadal durante el tratamiento continuado?:
1. Clomifeno.
2. Cetrorelix.
3. Buserelina.
4. Progesterona.

Respuesta correcta: 3. Buserelina.